El denominado cor pulmonale consiste en una sobrecarga del:
1. Ventrículo derecho, secundaria al edema pulmonar.
2. Ventrículo izquierdo, secundaria al edema pulmonar.
3. Ventrículo derecho, secundaria a la hipertensión pulmonar.
4. Ventrículo izquierdo, secundaria a la hipertensión pulmonar.

Respuesta correcta: 3. Ventrículo derecho, secundaria a la hipertensión pulmonar.